1歲6個月的男孩因為連續發燒6天而來就診，下列那一個臨床表徵最不像川崎氏症（Kawasaki disease）的 臨床表徵？
A. 草莓舌且嘴唇紅腫龜裂
B. 軟顎與扁桃腺出現水泡與潰瘍
C. 頸部淋巴結腫大
D. 雙眼結膜發炎

正確答案：B. 軟顎與扁桃腺出現水泡與潰瘍